Ranolazine為一新穎抗心絞痛藥物，其作用機轉為何？
A. 抑制late component of the Na+ current
B. 活化rapid component of the delayed rectifier K+ current
C. nitric oxide donor
D. alpha-1 adrenergic receptor blocker

正確答案：A. 抑制late component of the Na+ current